Clinical trial exclusion criterion:
Malignant neoplasm requiring chemotherapy, surgery, radiation or palliative therapy in the previous 5 years. Patients with intraepithelial squamous cell carcinoma of the skin treated with topical 5FU and subjects with basal cell skin cancer are allowed to enter the trial.

Annotated entities:
- Condition: "Malignant neoplasm"
- Procedure: "chemotherapy"
- Procedure: "surgery"
- Procedure: "radiation"
- Procedure: "palliative therapy"
- Temporal: "previous 5 years."
- Negation: "allowed"
- Condition: "intraepithelial squamous cell carcinoma"
- Qualifier: "skin"
- Drug: "topical 5FU"
- Condition: "basal cell skin cancer"